Clinical trial exclusion criterion:
Child Pugh class B or C

Entity relations:
- Has_value("Child Pugh class", "B or C")